for women of childbearing potential no negative pregnancy test and no agree to use reliable method of birth control during the study

The above is a clinical trial inclusion criterion. Annotated with entity spans:
[Pregnancy_considerations: for women of childbearing potential no negative pregnancy test and no agree to use reliable method of birth control during the study]